8. Patients with Grade 3 hyperbilirubinemia

The above is a clinical trial exclusion criterion. Annotated with entity spans:
[Parsing_Error: 8.] Patients with [Qualifier: Grade 3] [Condition: hyperbilirubinemia]